Clinical trial inclusion criterion:
Age = 50

Annotated entities:
- Person: "Age"
- Value: "= 50"